Clinical trial exclusion criterion:
Other significant condition that in the Investigator's opinion would exclude the subject from the trial.

Annotated entities:
- Post-eligibility: "Other significant condition that in the Investigator's opinion would exclude the subject from the trial"